Capable of the completion of bronchoscopy, alveolar lavage, pulmonary function testing etc;

The above is a clinical trial inclusion criterion. Annotated with entity spans:
[Post-eligibility: Capable of the completion of bronchoscopy, alveolar lavage, pulmonary function testing etc];